1. Currently pregnant or last pregnancy outcome within 3 months prior to enrolment

The above is a clinical trial exclusion criterion. Annotated with entity spans:
1. [Temporal: Currently] [Condition: pregnant] or [Qualifier: last] [Condition: pregnancy outcome] [Temporal: within 3 months prior to enrolment]